4. Have severe liver disease, kidney disease or cancer;

The above is a clinical trial exclusion criterion. Annotated with entity spans:
4. Have [Qualifier: severe] [Condition: liver disease], [Condition: kidney disease] or [Condition: cancer];